Age less than 15 or greater than 25 and not participating in the day care center

The above is a clinical trial exclusion criterion. Annotated with entity spans:
[Person: Age] [Value: less than 15] or [Value: greater than 25] and [Negation: not] [Observation: participating in the day care center]